Clinical trial exclusion criterion:
allergy/contra-indication for any drug used in the study

Entity relations:
- AND("allergy", "drug used in the study")
- OR("allergy", "contra-indication")